Clinical trial exclusion criterion:
Allergy to acetazolamide and other sulfonamides.

Entity relations:
- AND("Allergy", "acetazolamide")
- OR("acetazolamide", "sulfonamides")